Clinical trial exclusion criterion:
Known hypersensitivity to study drug (ferric carboxymaltose or equivalent) or its excipients

Entity relations:
- AND("hypersensitivity", "study drug")
- Subsumes("study drug", "ferric carboxymaltose")